Clinical trial exclusion criterion:
Any debilitating disease prior to the SCI that caused exercise intolerance

Annotated entities:
- Condition: "exercise intolerance"
- Condition: "debilitating disease"
- Temporal: "prior to the SCI"
- Reference_point: "the SCI"